2. Has provided verbal and written informed consent.

The above is a clinical trial inclusion criterion. Annotated with entity spans:
[Parsing_Error: 2.] [Post-eligibility: Has provided verbal and written informed consent.]